Clinical trial exclusion criterion:
Type 1 diabetes, as defined by ADA criteria

Annotated entities:
- Condition: "Type 1 diabetes"
- Qualifier: "ADA criteria"